expected to live under five years

The above is a clinical trial exclusion criterion. Annotated with entity spans:
[Observation: expected to live] [Value: under five years]